has practiced adequate contraception for 30 days prior to vaccination, and

The above is a clinical trial inclusion criterion. Annotated with entity spans:
has practiced [Qualifier: adequate] [Observation: contraception] for [Temporal: 30 days prior to vaccination], and